Clinical trial exclusion criterion:
Patients with bleeding disorders

Annotated entities:
- Condition: "bleeding disorders"